Patients in whom the preferred treatment is CABG(Coronary artery bypass grafting)

The above is a clinical trial exclusion criterion. Annotated with entity spans:
Patients in whom the preferred treatment is [Procedure: CABG]([Procedure: Coronary artery bypass grafting])